Los micro ARN (miARN):
1. Son ARN codificantes.
2. Inhiben la transcripción.
3. Inhiben la traducción.
4. Activan la transcripción.
5. Activan la traducción.

Respuesta correcta: 3. Inhiben la traducción.